Como profesional sanitario, usted debe tener unas cualidades/habilidades comunicativas. Basándose en el diálogo siguiente, identifique qué hace la enfermera: Paciente – No sé qué me van a hacer, tengo miedo de que algo salga mal en la operación. Enfermera – No se preocupe, tranquilícese, verá como todo saldrá bien.
1. Se muestra receptiva y fomenta la comunicación de aspectos más concretos.
2. Está dando falsas seguridades, ofrece respuestas tranquilizadoras sin base razonable.
3. La enfermera utiliza la técnica del señalamiento.
4. Está transmitiendo la propia seguridad de la enfermera.
5. Está atendiendo la ansiedad del paciente.

Respuesta correcta: 2. Está dando falsas seguridades, ofrece respuestas tranquilizadoras sin base razonable.